Al estado caracterizado por una total ausencia de conciencia, laxitud muscular, ausencia de respuesta a estímulos dolorosos y amnesia lacunar posterior, se le denomina:
1. Somnolencia.
2. Ausencia mental.
3. Estupor.
4. Coma.
5. Obnubilación.

Respuesta correcta: 4. Coma.